How are deletion breakpoints defined?

Molecular mapping of deletion breakpoints on chromosome 4 of Drosophila melanogaster. We identified 18 deletion breakpoints at the DNA nucleotide sequence level.  Commonly used methods for the detection of CNV breakpoints include long-range PCR and primer walking, their success being limited by the deletion size, GC content and presence of DNA repeats.